deep vein thrombosis

The above is a clinical trial exclusion criterion. Annotated with entity spans:
[Condition: deep vein thrombosis]